office blood pressure = 150/95 mmHg (confirmed on a second day; 24h ambulatory blood pressure measurement (ABPM) is allowed to check accuracy of office values; inclusion with 24h mean blood pressure = 145/90 mm Hg is possible); patients with hypertension should be treated according to current treatment guidelines

The above is a clinical trial inclusion criterion. Annotated with entity spans:
office [Measurement: blood pressure] [Value: = 150/95 mmHg] [Non-query-able: (confirmed on a second day; 24h ambulatory blood pressure measurement (ABPM) is allowed to check accuracy of office values; inclusion with 24h mean blood pressure = 145/90 mm Hg is possible); patients with hypertension should be treated according to current treatment guidelines]